Clinical trial exclusion criterion:
refusal of insulin

Annotated entities:
- Drug: "insulin"
- Condition: "refusal"